Clinical trial inclusion criterion:
Ability to understand and the willingness to sign a written informed consent document

Annotated entities:
- Post-eligibility: "Ability to understand and the willingness to sign a written informed consent document"
- Non-query-able: "Ability to understand and the willingness to sign a written informed consent document"